Patients who are medically unstable, patients who are seriously or terminally ill, and patients whose clinical course is unpredictable. For example:

The above is a clinical trial exclusion criterion. Annotated with entity spans:
Patients who are [Condition: medically unstable], patients who are [Condition: seriously] or [Condition: terminally ill], and patients whose [Condition: clinical course is unpredictable]. For example: